Clinical trial exclusion criterion:
Neurological Congenital malformations and/or those known to impair intestinal motility

Entity relations:
- OR("Neurological Congenital malformations", "impair intestinal motility")